下列關於酵素反應的敘述，何者錯誤？
A. 酵素可以改變化學反應的平衡常數，使正反應的速率上升
B. 大多數的酵素為蛋白質，但少數核醣核酸分子（RNA）亦具有催化能力
C. 一般化學反應的速率會隨著溫度升高而上升，但大多數酵素反應的速率在溫度過高時會顯著降低
D. 酵素可區分光學性質不同的受質，因此反應的立體專一性（stereo-specificity）極高

正確答案：A. 酵素可以改變化學反應的平衡常數，使正反應的速率上升